Clinical trial exclusion criterion:
Psychiatric troubles

Annotated entities:
- Condition: "Psychiatric troubles"